NO puede medirse directamente mediante espirometría, el volumen:
1. Corriente.
2. De reserva inspiratorio.
3. De reserva espiratorio.
4. Residual.

Respuesta correcta: 4. Residual.